Clinical trial exclusion criterion:
Previous ocular surgery history or ocular trauma that may confound the results of the study;

Entity relations:
- Has_temporal("ocular surgery", "Previous")
- Has_qualifier("ocular surgery", "may confound the results of the study")
- OR("ocular surgery", "ocular trauma")